Which yeast nucleosomes are preferentially marked by H2A.Z?

H2A.Z represses gene expression by establishing low gene accessibility at +1 nucleosome and maintaining high gene accessibility at -1 nucleosome. Ηigh measures of gene responsiveness correlate with the H2A.Z-associated closed +1 nucleosome structure.